Clinical trial exclusion criterion:
Diabetic patients

Annotated entities:
- Condition: "Diabetic"